¿Cuáles de las siguientes citoquinas ejercen un efecto anti-inflamatorio e inmunosupresor?
1. Interleucina-1 alfa, Interleucina-1 beta.
2. Tumor necrosis factor-alfa, Tumor necrosis factor-beta.
3. Interleucina-17, Interleucina-22.
4. Interleucina-10, Trasforming growth factorbeta.
5. Interleucina 2, Interferon-gamma.

Respuesta correcta: 4. Interleucina-10, Trasforming growth factorbeta.